Clinical trial exclusion criterion:
On colchicine chronically

Entity relations:
- Has_multiplier("colchicine", "chronically")